Clinical trial exclusion criterion:
CHF, angina or arrhythmias

Entity relations:
- OR("CHF", "angina", "arrhythmias")